Eastern Cooperative Oncology Group (ECOG) 0 or 1

The above is a clinical trial inclusion criterion. Annotated with entity spans:
[Measurement: Eastern Cooperative Oncology Group (ECOG)] [Value: 0 or 1]